Clinical trial exclusion criterion:
Patient currently requires dialysis

Annotated entities:
- Procedure: "dialysis"